Sobre los cuidados del postoperatorio de una artroplastia total de rodilla, indique el enunciado INCORRECTO:
1. Está contraindicado el uso de dispositivos de movimiento pasivo continuo.
2. Las enfermeras deben aconsejar al paciente la aplicación de hielo local el primer día.
3. La luxación no es un problema en este proceso.
4. Puede ser aconsejada la deambulación poco después de la cirugía.

Respuesta correcta: 1. Está contraindicado el uso de dispositivos de movimiento pasivo continuo.